Clinical trial exclusion criterion:
2. Ingestion of any alcoholic, caffeine- or xanthine-containing food or beverage within the 48 hours prior to the initial dose of study medication.

Annotated entities:
- Not_a_criteria: "Ingestion of any alcoholic, caffeine- or xanthine-containing food or beverage within the 48 hours prior to the initial dose of study medication."
- Parsing_Error: "2."